Clinical trial exclusion criterion:
Need for emergency surgery for any reason.

Annotated entities:
- Procedure: "emergency surgery"
- Mood: "Need for"